¿Cuál de los siguientes constituye un objetivo del programa de tratamiento para menores víctimas de abuso sexual de Deblinger y Heflin?:
1. Enseñar al niño habilidades de expresión emocional.
2. Olvidar el abuso.
3. Aumentar la desconfianza de los menores hacia los adultos.
4. Modificar la consulta sexual del menor.

Respuesta correcta: 1. Enseñar al niño habilidades de expresión emocional.